以下病理變化在高血壓性腎硬化（hypertensive nephrosclerosis）病灶中最不可能發生的是：
A. 腎小球硬化（glomerulosclerosis）
B. 小動脈硬化（arteriosclerosis）
C. 細動脈硬化（arteriolosclerosis）
D. 靜脈硬化（phlebosclerosis）

正確答案：D. 靜脈硬化（phlebosclerosis）